Clinical trial exclusion criterion:
Femoral sheath (artery)

Annotated entities:
- Condition: "Femoral sheath (artery)"